下列何者不是骨骼肌？
A. 肉膜肌（dartos muscle）
B. 梨狀肌（piriformis）
C. 提睪肌（cremasteric muscle）
D. 尿道外括約肌（external urethral sphincter）

正確答案：A. 肉膜肌（dartos muscle）